有關遠視眼（hyperopia）的敘述，下列何者是較正確的？
A. 可看清楚遠方者稱遠視眼
B. 遠視者看近處，不戴眼鏡是看不清楚的
C. 遠視眼看遠處不必戴眼鏡
D. 中老年人的遠視眼可用凸透鏡作光學矯正

正確答案：D. 中老年人的遠視眼可用凸透鏡作光學矯正